下列有關後縱隔腔腫瘤（posterior mediastinal tumor）之敘述，何者錯誤？
A. 最常見的為 schwannoma
B. 成年人惡性比例比小孩高
C. 最常見的惡性腫瘤為 neuroblastoma
D. 良性腫瘤治療以手術為主

正確答案：B. 成年人惡性比例比小孩高